Any confirmed or suspected immunosuppressive or immunodeficient condition, including HIV infection;

The above is a clinical trial exclusion criterion. Annotated with entity spans:
Any confirmed or suspected [Condition: immunosuppressive] or [Condition: immunodeficient condition], including [Condition: HIV infection];